Varón de 30 años que es traído al servicio de urgencias tras haber sufrido un accidente de tráfico. Se observa desviación de la tráquea cervical hacia el lado izquierdo y, en la auscultación hay ausencia de murmullo vesicular en hemitórax derecho. Presenta disnea intensa, Tensión Arterial de 89/45 mmHg, Frecuencia Cardiaca 120 lpm, con una saturación de oxigeno del 87%. ¿Cuál es la sospecha clínica?
1. Insuficiencia cardiaca congestiva.
2. Neumonía en lóbulo superior izquierdo.
3. Neumotórax a tensión.
4. Tuberculosis pulmonar.

Respuesta correcta: 3. Neumotórax a tensión.